Clinical trial inclusion criterion:
2. Patients undergoing primary or subsequent deceased-donor or living donor kidney transplantation.

Annotated entities:
- Multiplier: "primary"
- Multiplier: "subsequent"
- Procedure: "living donor kidney transplantation"
- Procedure: "deceased-donor kidney transplantation"